Milwaukee protocol was tested for treatment of which disease?

The Milwaukee protocol was tested for treatment of rabies. Therapies suggested in the Milwaukee protocol include therapeutic coma, ketamine infusion, amantadine, and the screening/prophylaxis/management of cerebral vasospasm. The Milwaukee Protocol has proved to be ineffective for rabies and should no longer be used.